Uno de los analizadores de masas más usado en el acoplamiento cromatografía de gases/espectrometría de masas es la trampa de iones. En éste:
1. Se almacenan los iones en un espacio definido por electrodos, de forma que el campo eléctrico expulsa secuencialmente los iones de valores m/z crecientes.
2. Sucede una deflexión de los iones en un campo magnético, de forma que la trayectoria de los iones depende del valor m/z.
3. Los iones se mueven en un campo de radiofrecuencias de corriente continua, pasando a través sólo los iones que tienen cierto valor de m/z.
4. Los iones con idéntica energía cinética entran en un tubo de deriva, de forma que la velocidad de deriva y por tanto, el tiempo de llegada al detector dependen de la masa.

Respuesta correcta: 1. Se almacenan los iones en un espacio definido por electrodos, de forma que el campo eléctrico expulsa secuencialmente los iones de valores m/z crecientes.